Clinical trial exclusion criterion:
3. Received donor lymphocyte infusion in last 28 days

Annotated entities:
- Parsing_Error: "3."
- Procedure: "donor lymphocyte infusion"
- Temporal: "in last 28 days"